Hypersensitivity, including allergy, to any component of vaccines, medicinal products or medical equipment whose use is foreseen in this study.

The above is a clinical trial exclusion criterion. Annotated with entity spans:
[Condition: Hypersensitivity], including [Condition: allergy], to any [Drug: component of vaccines], [Drug: medicinal products] or [Device: medical equipment] [Qualifier: whose use is foreseen in this study].